What is the function of the protein encoded by PUMILIO1?

Pumilio1 (Pum1) has been shown to play key roles in translational regulation of target mRNAs in many systems of diverse organisms.